What is PANTHER-PSEP?

PANTHER-PSEP is a new software tool for predicting non-synonymous genetic variants that may play a causal role in human disease.